Written informed consent must be obtained before any intravitreal injection of bevacizumab is performed

The above is a clinical trial inclusion criterion. Annotated with entity spans:
[Informed_consent: Written informed consent must be obtained before any intravitreal injection of bevacizumab is performed]